Clinical trial inclusion criterion:
HIV negative by 4th generation test (Ag/Ab test) or combination of enzymeimmunoassay (EIA) and HIV RNA

Annotated entities:
- Measurement: "HIV 4th generation test"
- Value: "negative"
- Measurement: "Ag/Ab test"
- Measurement: "enzymeimmunoassay"
- Measurement: "HIV RNA"
- Measurement: "EIA"